2. Evidence of STEMI within 72 hours of the intended treatment on infarct related or non-infarct related artery.

The above is a clinical trial exclusion criterion. Annotated with entity spans:
2. Evidence of [Condition: STEMI] [Temporal: within 72 hours] of the intended [Procedure: treatment] on [Qualifier: infarct related] or [Qualifier: non-infarct related artery].